Clinical trial exclusion criterion:
Patient refusing to participate to the study

Annotated entities:
- Post-eligibility: "Patient refusing to participate to the study"